Score 26 or higher on the Montreal Cognitive Assessment

The above is a clinical trial inclusion criterion. Annotated with entity spans:
Score [Value: 26 or higher] on the [Measurement: Montreal Cognitive Assessment]